Clinical trial inclusion criterion:
Are at least 18 years of age

Annotated entities:
- Value: "at least 18 years"
- Person: "age"